一位五個月大的小孩懷疑為腦膜炎，在尚未使用抗生素前，其腦脊髓液檢查結果如下：white cell count 250/mm3，mononuclear cell 85%，PMN 15%，sugar 60 mg/dL（其 blood sugar 110 mg/dL），protein  mg/dL；依上述他的腦膜炎較像那一類型腦膜炎？
A. 細菌性
B. 病毒性
C. 結核菌
D. 隱球菌

正確答案：B. 病毒性